Subject participated in an investigational drug study within 30 days prior to Visit 1

The above is a clinical trial exclusion criterion. Annotated with entity spans:
Subject [Observation: participated in an investigational drug study] [Temporal: within 30 days prior to Visit 1]